current suicidal risk

The above is a clinical trial exclusion criterion. Annotated with entity spans:
[Temporal: current] [Condition: suicidal risk]